Clinical trial exclusion criterion:
Concomitant medication that would interfere with study participation

Annotated entities:
- Context_Error: "Concomitant medication that would interfere with study participation"